關於急性闌尾炎（acute appendicitis）臨床診斷及治療之敘述，下列何者不適當？
A. 腹部超音波優點是高敏感性（sensitivity）及特異性（specificity），缺點是其正確性倚賴施行者之經驗（operator-dependent）
B. 電腦斷層具有高敏感性（sensitivity）（90%）及特異性（specificity）（85%），且又可降低陰性闌尾切除比率（negative appendectomy），是目前診斷闌尾炎之必要工具
C. 最常分離出之細菌為 Escherichia coli 及 Bacteroides
D. 經腹腔鏡闌尾切除（laparoscopic appendectomy）可以提供較短術後恢復時間及傷口美觀，且對於可能破裂之闌尾炎，經審慎評估後也可嘗試使用

正確答案：B. 電腦斷層具有高敏感性（sensitivity）（90%）及特異性（specificity）（85%），且又可降低陰性闌尾切除比率（negative appendectomy），是目前診斷闌尾炎之必要工具